Clinical trial exclusion criterion:
Patients with past treatment failures of aripiprazole

Entity relations:
- Has_context("aripiprazole", "treatment failures")